Hemoglobin: ≥ 9 g/dL

The above is a clinical trial inclusion criterion. Annotated with entity spans:
[Measurement: Hemoglobin]: [Value: ≥ 9 g/dL]